有關皮膚黑色素細胞癌 （cutaneous melanoma）的敘述，下列何者正確？
A. 在歐美白種人最常見的亞型是結節型黑色素細胞癌（nodular melanoma）
B. 肢端黑痣型黑色素細胞癌（acral lentiginous melanoma）不會發生在指甲處
C. 惡性黑痣型黑色素細胞癌（lentigo maligna melanoma）常見於40歲以下的青壯年人
D. 表淺擴散型黑色素細胞癌（superficial spreading melanoma）好發於男性的上背和女性的下肢

正確答案：D. 表淺擴散型黑色素細胞癌（superficial spreading melanoma）好發於男性的上背和女性的下肢